Clinical trial inclusion criterion:
Histologic or cytologic diagnosis of stage IIIB/IV NSCLC

Entity relations:
- Has_qualifier("NSCLC", "stage IIIB/IV")
- AND("NSCLC", "cytologic")
- AND("NSCLC", "Histologic")